黴漿菌（Mycoplasma）的體表抗原性，主要是由下列何種成分所決定？
A. 莢膜多糖體（Capsular polysaccharides）
B. 鞭毛蛋白（Flagellin）
C. 細胞膜蛋白（Membrane proteins）
D. 脂多糖體（Lipopolysaccharides）

正確答案：C. 細胞膜蛋白（Membrane proteins）